Clinical trial inclusion criterion:
Have stable renal function for one month (30 days) prior to enrollment

Entity relations:
- Has_value("renal function", "stable")
- Has_index("one month (30 days) prior to enrollment", "enrollment")
- Has_temporal("renal function", "one month (30 days) prior to enrollment")